Clinical trial inclusion criterion:
Have read and signed the IRB-approved Informed Consent form for participating in the study.

Annotated entities:
- Post-eligibility: "Have read and signed the IRB-approved Informed Consent form for participating in the study."